滿月嬰兒若於餵食後呈現噴射狀嘔吐，須懷疑幽門肥厚性狹窄（hypertrophic pyloric stenosis），下列有關 檢查及治療之敘述，何者最正確？
A. 確定診斷可借助腹部觸診發現右上腹橄欖狀硬塊、腹部超音波或上消化道攝影
B. 平躺腹部X光檢查可發現雙氣泡徵象（double bubble sign）
C. 嬰兒幽門肥厚性狹窄因屬腸胃道阻塞之一，通常屬於外科急症（surgical emergency）
D. 手術治療目前以幽門成形手術（pyloroplasty）為主

正確答案：A. 確定診斷可借助腹部觸診發現右上腹橄欖狀硬塊、腹部超音波或上消化道攝影